下列有關法洛氏四合症（tetralogy of Fallot）的心室中隔缺損之敘述，何者錯誤？
A. 其缺損大小，往往等於主動脈環內徑甚至比它大（nonrestrictive）
B. 往往為膜周出口型（perimembranous outlet）
C. 其傳導組織之位置和一般心室中隔缺損相同
D. 往往是向後歪位（posterior malalignment）

正確答案：D. 往往是向後歪位（posterior malalignment）